Clinical trial exclusion criterion:
Body mass index (BMI) of 35 kg/m2 or more.

Annotated entities:
- Measurement: "Body mass index (BMI)"
- Value: "35 kg/m2 or more"